What is PPROM?

Preterm premature(Prelabor) rupture of fetal membranes  is often abbreviated as PPROM, and is  defined as rupture of membranes before the onset of labor at < 37 weeks' gestation, affects approximately 3% of all pregnancies